Clinical trial exclusion criteria:
The patient's data will be excluded if they die within 3 days of hospital admission.

Annotated entities:
- Observation: "die"
- Temporal: "within 3 days of hospital admission"
- Reference_point: "hospital admission"